Clinical trial exclusion criterion:
Affected by alcohol or drugs during the last month.

Entity relations:
- Has_temporal("alcohol", "last month")
- OR("alcohol", "drugs")